下列有關注意力缺損／過動症（ADHD）兒童的敘述何者錯誤？
A. 由於其學業成就低、人際關係不佳，常常導致自尊心低落，在青春期時可能會加入偏差行為同儕團體
B. 應用行為治療時，必須要有詳盡的行為觀察、詳細說明行為契約、適時給予回饋物
C. 低於1/10的ADHD兒童到成年期仍符合ADHD診斷
D. 目前台灣衛生福利部核准用以治療ADHD的藥物包括methylphenidate和atomoxetine

正確答案：C. 低於1/10的ADHD兒童到成年期仍符合ADHD診斷